Clinical trial exclusion criterion:
Known subjects with renal, liver, calcium metabolism disorders, malabsorption disorders, known neoplasms.

Entity relations:
- OR("calcium metabolism disorders", "malabsorption disorders", "disorders renal", "disorders liver", "neoplasms")